¿Cuál de las siguientes es hoy día la única contraindicación para el tratamiento quirúrgico conservador en el cáncer de mama?
1. Radioterapia previa.
2. Tumor de 4 cm.
3. Metástasis axilar.
4. Tumor multifocal.
5. Embarazo de 32 semanas.

Respuesta correcta: 1. Radioterapia previa.